Clinical trial inclusion criterion:
Subjects chronically infected with HCV Genotype 1

Annotated entities:
- Condition: "HCV"
- Qualifier: "Genotype 1"
- Temporal: "chronically"
- Multiplier: "chronically"